En una paciente de 30 años se encuentra una cifra de calcio de 11 mg/dl (normal menos de 10,5 mg/dl) durante un examen de empresas rutinario. La determinación de PTH fue de 45 pg/ml (VN 10-55 pg/ml). La historia es anodina, salvo por el hecho de que la madre y el abuelo paterno fueron diagnosticados de hiperparatiroidismo e intervenidos, aunque permanecieron hipercalcémicos. ¿Qué prueba es más útil para confirmar el diagnóstico?
1. 25-OH D.
2. 1,25-OH 2D.
3. Cociente calcio/creatinina en orina.
4. Reabsorción tubular de fosfatos.
5. PTHrP.

Respuesta correcta: 3. Cociente calcio/creatinina en orina.